Clinical trial inclusion criterion:
Plaque psoriasis with =2% Body Surface Area (BSA) involvement (may include scalp involvement), PASI Score = 2, IGA mod 2011 score of 2 or greater (based on scale of 0-4)

Annotated entities:
- Condition: "Plaque psoriasis"
- Value: "=2% Body Surface Area (BSA)"
- Measurement: "involvement"
- Measurement: "PASI Score"
- Value: "= 2"
- Measurement: "IGA mod 2011 score"
- Value: "2 or greater"
- Qualifier: "scale of 0-4"